List 2 approved drug treatments for Inflammatory Bowel Disease (IBD).

Patients with IBD, inflammtory Bowel Disease can be treated with steroids, or 2 approved biosimilar drugs infliximab (IFX) or adalimumab (ADA)